Other contraindications mentioned in the "Summary of Product Characteristics" for the respective NOAC.

The above is a clinical trial exclusion criterion. Annotated with entity spans:
[Qualifier: Other] [Condition: contraindications] mentioned in the "[Qualifier: Summary of Product Characteristics]" for the respective [Drug: NOAC].